Clinical trial inclusion criterion:
3. A documented history of severe Symptomatic Orthostatic Hypotension (SOH) that, in the judgment of the treating physician, has required treatment with midodrine HCl , and has been at a stable dose for at least 3 months.

Entity relations:
- Has_temporal("stable dose", "for at least 3 months")
- Has_qualifier("Symptomatic Orthostatic Hypotension (SOH)", "severe")